急性胰臟炎局部合併症中，下列何者最不常見？
A. pancreatic phlegmon
B. pancreatic abscess
C. pancreatic pseudocyst
D. renal artery thrombosis

正確答案：D. renal artery thrombosis